With the presence of a non-carious cervical lesion (LCNCs) that needs to be restored. This lesion should be non-carious, non-retentive, with at least 1 mm and up to 3 mm depth, should involve both enamel and dentin of vital teeth without mobility, and present hypersensitivity;

The above is a clinical trial inclusion criterion. Annotated with entity spans:
With the presence of a [Condition: non-carious cervical lesion (LCNCs)] that [Mood: needs to be] [Procedure: restored]. This [Condition: lesion] should be [Qualifier: non-carious], [Qualifier: non-retentive], with [Value: at least 1 mm and up to 3 mm] [Measurement: depth], should [Qualifier: involve both enamel and dentin] of vital teeth without mobility, and present [Condition: hypersensitivity];